Clinical trial inclusion criterion:
Age = 18 years old

Entity relations:
- Has_value("Age", "= 18 years old")